14. Uncontrolled or significant cardiovascular disease

The above is a clinical trial exclusion criterion. Annotated with entity spans:
14. [Qualifier: Uncontrolled] or [Qualifier: significant] [Condition: cardiovascular disease]